La tinción con blanco de calcoflúor permite observar:
1. Espiroquetas.
2. Endosporas bacterianas.
3. Flagelos bacterianos.
4. Hifas de hongos filamentosos.
5. Corpúsculos metacromáticos.

Respuesta correcta: 4. Hifas de hongos filamentosos.